Known levetiracetam allergy

The above is a clinical trial exclusion criterion. Annotated with entity spans:
Known [Drug: levetiracetam] [Condition: allergy]